Clinical trial inclusion criterion:
proven pelvic floor dysfunction

Annotated entities:
- Condition: "pelvic floor dysfunction"